下列何者是最理想的膝下經脛骨（trans-tibial）截肢殘肢長度為原脛骨長度的百分比？
A. 80%
B. 60%
C. 40%
D. 20%

正確答案：C. 40%